Clinical trial exclusion criterion:
Prior allergic reaction to any type of local anesthetic

Annotated entities:
- Condition: "allergic reaction"
- Drug: "local anesthetic"